Clinical trial exclusion criterion:
Life limiting disease or substance abuse which may affect participation

Entity relations:
- Has_qualifier("Life limiting disease", "may affect participation")
- OR("Life limiting disease", "substance abuse")